Clinical trial inclusion criterion:
No prior use of somatostatin analogues.

Annotated entities:
- Drug: "somatostatin analogues"
- Negation: "No"
- Temporal: "prior"